下列何者最可能是人工瓣膜手術後2個月內引發心內膜炎（prosthetic valve endocarditis）的致病菌？
A. 流感嗜血桿菌（Hemophilus influenzae）
B. 萬古黴素抗藥性腸球菌屬（vancomycin-resistant Enterococcus species）
C. 肺炎鏈球菌（Streptococcus pneumoniae）
D. 表皮葡萄球菌（Staphylococcus epidermidis）

正確答案：D. 表皮葡萄球菌（Staphylococcus epidermidis）